Clinical trial exclusion criterion:
Active infection with human cytomegaly virus (HCMV), Epstein-Barr virus (EBV), varicella-zoster virus (VZV)

Entity relations:
- Has_qualifier("infection", "Active")
- Subsumes("human cytomegaly virus", "HCMV")
- Subsumes("Epstein-Barr virus", "EBV")
- Subsumes("varicella-zoster virus", "VZV")
- Has_qualifier("infection", "human cytomegaly virus")
- OR("human cytomegaly virus", "Epstein-Barr virus", "varicella-zoster virus")